Clinical trial exclusion criterion:
Overlap syndrome with Primary Sclerosing Cholangitis (PSC) or Primary Biliary Cholangitis (PBC) (Paris criteria, strong positive Anti-Mitochondrial Antibodies (AMA), past liver biopsy or cholangiographic findings compatible with PBC or PSC).

Annotated entities:
- Condition: "Overlap syndrome"
- Condition: "Primary Sclerosing Cholangitis"
- Condition: "PSC"
- Condition: "Primary Biliary Cholangitis"
- Condition: "PBC"
- Measurement: "Paris criteria,"
- Measurement: "Anti-Mitochondrial Antibodies"
- Value: "strong positive"
- Measurement: "AMA"
- Procedure: "liver biopsy"
- Procedure: "cholangiographic findings"
- Condition: "PBC"
- Condition: "PSC"